How do the plasma concentrations of amantadine extended release and amantadine immediate release compare?

When it is given at bedtime, it reaches plasma concentration approximately twice the level achieved by amantadine immediate release.